Transplanted patients or patients suffering from severe auto-immune disease.

The above is a clinical trial exclusion criterion. Annotated with entity spans:
[Procedure: Transplanted] patients or patients suffering from [Condition: severe auto-immune disease].